雙股DNA melting temperature之定義，是多少百分比的DNA分子產生變性（denaturation）時的溫度？
A. 25%
B. 50%
C. 75%
D. 100%

正確答案：B. 50%